Clinical trial inclusion criterion:
Females of childbearing potential must agree to be abstinent or else use any two of the following medically acceptable forms of contraception from the Screening Period through the Final Study Visit: hormonal, condom with spermicidal jelly, diaphragm or cervical cap with spermicidal jelly, or IUD. Hormonal contraception must have started at least 3 months prior to screening. A female whose male partner has had a vasectomy must agree to use one additional form of medically acceptable contraception. Subjects must agree to practice the above birth control methods for 30 days from the final visit as a safety precaution.

Annotated entities:
- Condition: "childbearing potential"
- Non-query-able: "Females of childbearing potential must agree to be abstinent or else use any two of the following medically acceptable forms of contraception from the Screening Period through the Final Study Visit: hormonal, condom with spermicidal jelly, diaphragm or cervical cap with spermicidal jelly, or IUD."
- Post-eligibility: "Females of childbearing potential must agree to be abstinent or else use any two of the following medically acceptable forms of contraception from the Screening Period through the Final Study Visit: hormonal, condom with spermicidal jelly, diaphragm or cervical cap with spermicidal jelly, or IUD."
- Procedure: "Hormonal contraception"
- Temporal: "at least 3 months prior to screening"
- Reference_point: "screening"
- Post-eligibility: "A female whose male partner has had a vasectomy must agree to use one additional form of medically acceptable contraception."
- Post-eligibility: "Subjects must agree to practice the above birth control methods for 30 days from the final visit as a safety precaution."
- Non-query-able: "A female whose male partner has had a vasectomy must agree to use one additional form of medically acceptable contraception."
- Non-query-able: "Subjects must agree to practice the above birth control methods for 30 days from the final visit as a safety precaution."